Clinical trial exclusion criterion:
Subject has any contraindication for oral anticoagulation.

Entity relations:
- AND("contraindication", "oral anticoagulation")